有一位 25 歲產婦足月生產下一個嬰兒，具斜瞼裂，兩耳位置較低，並有右手掌斷掌紋及心臟雜音。 此嬰兒長大至約 10 歲時其心智障礙仍然是相當輕微。病人可能具有下列何種染色體之變化？
A. 單倍體（Haploidy）
B. 單體染色體（Monosomy）
C. 鑲嵌型染色體（Mosaicism）
D. 三倍體性（Triploidy）

正確答案：C. 鑲嵌型染色體（Mosaicism）